La aparición del estreñimiento es un síntoma que aparece con frecuencia cuando se consume:
1. Tabaco.
2. Alcohol.
3. Cannabis.
4. Cocaína.
5. Heroína.

Respuesta correcta: 5. Heroína.